diabetic

The above is a clinical trial exclusion criterion. Annotated with entity spans:
[Condition: diabetic]